病人出現右下肢振動（vibration）感覺異常，左下肢輕觸覺及痛覺異常，最可能的病灶位於：
A. 右側胸段脊髓（right thoracic spinal cord）
B. 右側丘腦（right thalamus）
C. 左側延髓（left medulla）
D. 左側大腦感覺皮質（left sensory cortex）

正確答案：A. 右側胸段脊髓（right thoracic spinal cord）